Clinical trial exclusion criterion:
Known bleeding disorder (e.g,. dysfibrinogenemia, factor IX deficiency, hemophilia, Von Willebrand's disease, disseminated intravascular coagulation (DIC), fibrinogen deficiency, or clotting factor deficiency)

Entity relations:
- Subsumes("disseminated intravascular coagulation", "DIC")
- Subsumes("bleeding disorder", "dysfibrinogenemia")
- OR("dysfibrinogenemia", "factor IX deficiency", "hemophilia", "Von Willebrand's disease", "disseminated intravascular coagulation", "fibrinogen deficiency", "clotting factor deficiency")